Clinical trial exclusion criterion:
24. HIV-positive

Annotated entities:
- Parsing_Error: "24."
- Measurement: "HIV"
- Value: "positive"